What is the inheritance pattern of Li–Fraumeni syndrome?

Li-Fraumeni syndrome shows autosomal dominant inheritance.